Clinical trial inclusion criterion:
Ultrasound confirmed complete mole

Entity relations:
- AND("Ultrasound", "complete mole")